Patients under the age of 18 years

The above is a clinical trial exclusion criterion. Annotated with entity spans:
Patients [Value: under] the [Person: age] of 18 years